一位68歲女性有狹心症病史數年，一年前右側甲狀腺無意間發現一2.5 cm結節，當時心律正常，體重58公斤，free T4 1.6 ng/dL（normal range 0.8～1.8 ng/dL），T3 120 ng/dL （normal range 80～180 ng/dL），TSH 0.15µIU/mL（normal range 0.1～2.0 µIU/mL）。甲狀腺I-131掃瞄顯示右側甲狀腺結節為熱結節（hot nodule）左側甲狀腺顯影減低。最近她來追蹤，體重53公斤，心悸會喘，下肢水腫，心電圖顯示心房震顫，	血發現free T4 2.3 
 ng/dL，T3 220 ng/dL，TSH＜0.2 µIU/mL；甲狀腺右葉結節大小與之前相同。最好的治療方式為何？
A. 持續追蹤甲狀腺結節大小
B. 甲狀腺超音波檢查及甲狀腺功能追蹤
C. 甲狀腺右葉結節手術切除
D. 甲狀腺I-131放射治療

正確答案：D. 甲狀腺I-131放射治療